Clinical trial inclusion criterion:
Ultrasound confirmed complete mole

Annotated entities:
- Procedure: "Ultrasound"
- Condition: "complete mole"